Patient has a current malignancy or a history of malignancy (within the past 5 years), except hepatocellular carcinoma within UCSF Criteria and basal or non-metastatic squamous cell carcinoma of skin that has been treated successfully.

The above is a clinical trial exclusion criterion. Annotated with entity spans:
Patient has a current [Condition: malignancy] or a [Condition: history of malignancy] ([Temporal: within the past 5 years]), [Negation: except] [Condition: hepatocellular carcinoma] within [Measurement: UCSF Criteria] and [Condition: basal] or [Qualifier: non-metastatic] [Condition: squamous cell carcinoma of skin] that has been [Mood: treated successfully].